CPPE along with evidence of septated pleural effusion on pleural ultrasonography and/or chest CT scan

The above is a clinical trial inclusion criterion. Annotated with entity spans:
[Condition: CPPE] along with [Mood: evidence of] [Condition: septated pleural effusion] on [Procedure: pleural ultrasonography] and/or [Procedure: chest CT scan]